Clinical trial inclusion criterion:
Preoperative measurement of corneal astigmatism indicate the subjects are suitable for multifocal intraocular lenses implantation;

Annotated entities:
- Measurement: "measurement of corneal astigmatism"
- Procedure: "multifocal intraocular lenses implantation"
- Value: "suitable"
- Temporal: "Preoperative"